Clinical trial exclusion criterion:
Syncope related to cardiac disease

Annotated entities:
- Condition: "Syncope"
- Condition: "cardiac disease"